Clinical trial inclusion criterion:
Hepatitis B virus DNA <100 IU/mL.

Annotated entities:
- Measurement: "Hepatitis B virus DNA"
- Value: "<100 IU/mL"